What disease is associated with mutations in the MECP2 transcription factor?

Mutations in the methyl-CpG-binding protein-2 gene (MECP2) are commonly associated with Rett syndrome.